Clinical trial inclusion criterion:
9. Signed written informed consent

Annotated entities:
- Parsing_Error: "9."
- Post-eligibility: "Signed written informed consent"